某病人罹患慢性阻塞性肺病（COPD），為了減輕他呼吸窘迫的症狀，應該要建議下列何項呼吸訓練運動？
A. 橫膈膜呼吸運動（diaphragmatic breathing）＋舌咽呼吸運動（glossopharyngeal breathing）
B. 橫膈膜呼吸運動＋圓唇呼吸運動（pursed-lip breathing）
C. 呼吸型式（breathing patterns）調整＋舌咽呼吸運動
D. 圓唇呼吸運動＋舌咽呼吸運動

正確答案：B. 橫膈膜呼吸運動＋圓唇呼吸運動（pursed-lip breathing）